Clinical trial exclusion criterion:
Presence of any infertility factor other than anovulatory PCOS.

Entity relations:
- Has_negation("anovulatory PCOS", "other than")